Clinical trial exclusion criterion:
F4 or decompensated cirrhotic patients

Entity relations:
- OR("F4", "decompensated cirrhotic")